先天性鼻淚管阻塞的原因是在那一個部位發生阻塞？
A. 淚小管
B. 淚囊
C. Rosenmuller 氏瓣膜
D. Hasner 氏瓣膜

正確答案：D. Hasner 氏瓣膜